Una modalidad de inyección muy empleada en cromatografía de gases es la inyección con división de flujo o “Split”, en la que:
1. La muestra introducida a través del septum se vaporiza bruscamente y es arrastrada por el gas portador hacia la columna.
2. El divisor de flujo se cierra, se introduce la muestra, y se vuelve a abrir después de un periodo controlado de tiempo del orden de 15 a 60 s.
3. El disolvente se condensa a la entrada de la columna formando una fase mixta de elevado espesor cuando se cierra el divisor.
4. El gas portador que arrastra la muestra, una vez evaporada, se divide en dos partes: una pasa a la columna y la otra se envía al exterior.
5. La muestra se introduce en frío y una parte se deposita sobre un relleno y se calienta rápidamente para producir la evaporación homogénea de la disolución.

Respuesta correcta: 4. El gas portador que arrastra la muestra, una vez evaporada, se divide en dos partes: una pasa a la columna y la otra se envía al exterior.